Clinical trial exclusion criterion:
mild (GOLD 1) or very severe COPD (GOLD 4)

Annotated entities:
- Condition: "COPD"
- Qualifier: "mild"
- Measurement: "GOLD"
- Value: "1)"
- Measurement: "GOLD"
- Value: "4"
- Qualifier: "very severe"
- Condition: "COPD"